Severe critical limb ischemia (Rutherford category 6)

The above is a clinical trial exclusion criterion. Annotated with entity spans:
[Qualifier: Severe] [Qualifier: critical] [Condition: limb ischemia] ([Measurement: Rutherford category] [Value: 6])